若以體表面積矯正之肌酐酸廓清率（creatinine clearance rate; mL/min/1.732m2）來估算腎絲球過濾率（glomerular filtration rate）。兒童之腎絲球過濾率（glomerular filtration rate）平均在出生後多久會發展到成人般的數值？
A. 第 3 個月
B. 第 6 個月
C. 第 9 個月到第 12 個月
D. 第 2 年到第 3 年

正確答案：D. 第 2 年到第 3 年